Clinical trial inclusion criterion:
written informed consent

Annotated entities:
- Informed_consent: "written informed consent"